Clinical trial inclusion criterion:
Hepatitis B e antigen (HBeAg)-negative and anti-HBeAg positive.

Annotated entities:
- Measurement: "Hepatitis B e antigen"
- Value: "negative"
- Measurement: "anti-HBeAg"
- Value: "positive"
- Measurement: "HBeAg"